Clinical trial inclusion criterion:
Is eligible to receive comprehensive medical care from Garrison Petawawa

Annotated entities:
- Non-query-able: "Is eligible to receive comprehensive medical care from Garrison Petawawa"